Which deiodinases are best known to be present in brain?

All the 3 deiodinases (Type 1, Type 2 and Type 3 deiodinase) are present in the "brain" but Type 1 deiodinase  is only found in neurohypophysis that cannot be actually considered true "brain tissue".